Clinical trial exclusion criterion:
Severe pulmonary disease requiring consistent treatment

Annotated entities:
- Condition: "pulmonary disease"
- Procedure: "consistent treatment"
- Mood: "requiring"
- Qualifier: "Severe"